Clinical trial exclusion criterion:
History of regular alcohol consumption within 6 months of the study defined as: An average weekly intake of >21 units for males or >14 units for females. One unit is equivalent to 8 gram of alcohol: a half-pint (approximately 240 milliliter [mL]) of beer, 1 glass (100 mL) of wine or 1 (25 mL) measure of spirits.

Entity relations:
- Has_temporal("regular alcohol consumption", "History")
- Has_index("within 6 months of the study", "the study")
- Has_value("females", ">14 units")
- Has_value("males", ">21 units")
- AND("average weekly intake", "males")
- AND("regular alcohol consumption", "average weekly intake")
- Has_temporal("regular alcohol consumption", "within 6 months of the study")
- OR("males", "females")